Clinical trial exclusion criterion:
serious bleeding during the course of the ulcer

Entity relations:
- multi("the ulcer", "ulcer")
- Has_index("during the course of the ulcer", "the ulcer")
- Has_qualifier("bleeding", "serious")
- Has_temporal("bleeding", "during the course of the ulcer")